Clinical trial exclusion criterion:
Symptomatic, unstable or uncontrolled, cardiac arrhythmias. Patients who have stable, rate-controlled atrial fibrillation are eligible for study enrollment.

Entity relations:
- Has_qualifier("cardiac arrhythmias", "Symptomatic")
- Has_negation("atrial fibrillation", "are eligible")
- Has_qualifier("atrial fibrillation", "rate-controlled")
- Has_qualifier("atrial fibrillation", "stable")
- OR("Symptomatic", "unstable", "uncontrolled")